Clinical trial exclusion criterion:
Haemochromatosis

Annotated entities:
- Condition: "Haemochromatosis"